If 30 days have not elapsed after the date of signing of the previous clinical trial or currently participating in other clinical trials.

The above is a clinical trial exclusion criterion. Annotated with entity spans:
[Competing_trial: If 30 days have not elapsed after the date of signing of the previous clinical trial or currently participating in other clinical trials.]